Patients who sign the consent form

The above is a clinical trial inclusion criterion. Annotated with entity spans:
[Informed_consent: Patients who sign the consent form]